乳癌的病患有時會利用 Tamoxifen（一種激素拮抗劑）來做為輔助治療。下列有關此藥劑之敘述，何者正確？
A. Tamoxifen 是一種男性激素的拮抗劑（antagonist）
B. 對激素受體呈陰性的乳癌患者效果較好
C. 經由癌細胞表面之特殊受器（receptor）進入細胞
D. 進入細胞後，與激素受器結合，改變基因表達

正確答案：D. 進入細胞後，與激素受器結合，改變基因表達